一位 18 歲女學生，只要一上台或與陌生人接觸就馬上出現明顯的焦慮不安、冒冷汗、心跳加快，並擔心自己出糗，使得她刻意逃避接觸人群與上台，這樣子的困擾已一年多，而且對於個案的人際關係與學校表現造成明顯的障礙。關於此個案的臨床問題，下列何者錯誤？
A. 此類疾病，女性多於男性
B. 此類疾病，好發於兒童期晚期與青少年早期
C. 此類疾病的終身盛行率達 25%
D. 心理治療合併藥物治療的療效優於單獨使用任一種治療的療效

正確答案：C. 此類疾病的終身盛行率達 25%